Hypertension (BP>140/90 mmHg);

The above is a clinical trial exclusion criterion. Annotated with entity spans:
[Condition: Hypertension] ([Measurement: BP][Value: >140/90 mmHg]);